Clinical trial exclusion criterion:
15. Female subject is pregnant or plan to become pregnant

Annotated entities:
- Person: "Female"
- Condition: "pregnant"
- Mood: "plan"
- Condition: "pregnant"